Clinical trial inclusion criterion:
=18 years old, men or post-menopausal women (women with no periods for 12 months or more, or those who have had a surgical menopause)

Entity relations:
- Has_value("years old", "=18")
- AND("women", "post-menopausal")
- AND("menopause", "surgical")
- Has_temporal("no periods", "for 12 months or more")
- Subsumes("post-menopausal", "no periods")
- OR("men", "women")
- OR("no periods", "menopause")